What disease is mirtazapine predominantly used for?

Mirtazapine is predominantly used in the treatment of major depression.